Severe liver dysfunction (LFT 3X upper limit of normal)

The above is a clinical trial exclusion criterion. Annotated with entity spans:
[Qualifier: Severe] [Condition: liver dysfunction] ([Measurement: LFT] [Value: 3X upper limit of normal])